Extra-pulmonary infection requiring antibiotic therapy (e.g. meningitis)

The above is a clinical trial exclusion criterion. Annotated with entity spans:
[Qualifier: Extra-pulmonary] [Condition: infection] requiring [Procedure: antibiotic therapy] (e.g. [Condition: meningitis])